Clinical trial exclusion criterion:
Congenital or organic bowel pathology

Entity relations:
- OR("Congenital bowel pathology", "organic bowel pathology")